Clinical trial exclusion criterion:
Convulsions, except the ones caused by fever, before 2 years old;

Annotated entities:
- Condition: "Convulsions"
- Temporal: "before 2 years old"
- Qualifier: "caused by fever"
- Negation: "except"
- Condition: "fever"
- Reference_point: "2 years old"